有關乳酸林格氏液（lactated Ringer's solution）組成成分，下列何者正確？
A. 鈉離子130 mEq/L
B. 鉀離子3 mEq/L
C. 鈣離子4 mEq/L
D. 乳酸24 mEq/L

正確答案：A. 鈉離子130 mEq/L